下列何者為 B 型肝炎最獨特的病理表現？
A. 荳蔻肝（nutmeg liver）
B. 毛玻璃狀肝細胞（ground-glass hepatocytes）
C. 馬洛里氏小體（Mallory bodies）
D. 脂肪變性（steatosis）

正確答案：B. 毛玻璃狀肝細胞（ground-glass hepatocytes）